Clinical trial exclusion criterion:
Patients affected by malignancy;

Annotated entities:
- Condition: "malignancy"